Clinical trial exclusion criterion:
History of statin intolerance to any other drug.

Entity relations:
- AND("intolerance", "statin")